Clinical trial exclusion criterion:
Subjects who are smokers or who have quit smoking <5 years ago

Entity relations:
- Has_temporal("quit smoking", "<5 years ago")
- OR("smokers", "quit smoking")